Clinical trial inclusion criterion:
Epilepsy partial seizure subjects.

Entity relations:
- AND("Epilepsy", "partial seizure")